Children will be excluded if they have a history of developmental delay or inability to communicate the effects of an allergic reaction (non-verbal).

The above is a clinical trial exclusion criterion. Annotated with entity spans:
[Person: Children] will be excluded if they have a history of [Condition: developmental delay] or [Condition: inability to communicate the effects] of an [Condition: allergic reaction] ([Qualifier: non-verbal]).